¿Cuál de estas afirmaciones es FALSA respecto al estupor?
1. Es una alteración de la conciencia.
2. Puede darse en la melancolía.
3. Supone un estado reversible por estímulos moderados.
4. Se utiliza el término en estados de mutismo y reducción de la actividad motora.
5. En Neurología es un estado que precede al coma.

Respuesta correcta: 3. Supone un estado reversible por estímulos moderados.